Clinical trial exclusion criterion:
Current triglyceride level > 400 mg/dl

Annotated entities:
- Measurement: "triglyceride level"
- Value: "> 400 mg/dl"